關於骨骼肌肉系統的創傷，下列敘述何者錯誤？
A. 截肢病人若出現休克現象就要立即進行接合手術（replantation）
B. 骨折固定可減少疼痛及避免進一步軟組織傷害
C. 懷疑有動脈血管損傷必須考慮安排血管攝影檢查
D. 近關節處的傷口不要嘗試從傷口注入生理食鹽水來檢查是否與關節腔相通

正確答案：A. 截肢病人若出現休克現象就要立即進行接合手術（replantation）